On standard immunosuppression with tacrolimus and prednisone

The above is a clinical trial inclusion criterion. Annotated with entity spans:
On [Procedure: standard immunosuppression] with [Drug: tacrolimus] and [Drug: prednison]e